Clinical trial inclusion criterion:
Cervical length of 15-25 mm by transvaginal sonography (TVS) at 16-24 weeks of gestation.

Entity relations:
- Has_value("gestation", "16-24 weeks")
- multi("16-24 weeks of gestation", "gestation")
- Has_index("at 16-24 weeks of gestation", "16-24 weeks of gestation")
- Has_temporal("transvaginal sonography (TVS)", "at 16-24 weeks of gestation")
- Has_value("Cervical length", "15-25 mm")
- AND("Cervical length", "transvaginal sonography (TVS)")